La función principal de las quimiocinas es:
1. Regular el tráfico linfocitario.
2. Estimular la proliferación celular en respuesta a agentes químicos.
3. Amplificar la producción de citoquinas antivirales.
4. Regular la selección en el timo.
5. Antagonizar algunas citoquinas.

Respuesta correcta: 1. Regular el tráfico linfocitario.